以手電筒照射病患左眼時，其左瞳孔收縮，右瞳孔無反應，其可能的原因為？
A. 病患兩眼完全正常
B. 右視神經失能
C. 左視神經失能
D. 右動眼神經受損

正確答案：D. 右動眼神經受損